At the discretion of the operating surgeon, ANC>1000/mcl and platelets>100,000/mcl.

The above is a clinical trial inclusion criterion. Annotated with entity spans:
[Subjective_judgement: At the discretion of the operating surgeon], [Measurement: ANC][Value: >1000/mcl] and [Measurement: platelets][Value: >100,000/mcl].